下列投藥路徑，何者較易產生首渡效應（first-pass effect）？
A. 直腸給藥（rectal）
B. 經皮吸收（transdermal patch）
C. 舌下給藥（sublingual）
D. 口服給藥（oral）

正確答案：D. 口服給藥（oral）